一位 37 歲女性因水腫就診。病人半年前曾做過一般性健檢，結果無異常。一個月前開始有間歇性微燒，一週前出現足踝水腫，並有尿量減少。理學檢查，體溫 38.2℃，脈搏每分鐘 98 下，血壓 164/96 mmHg，皮膚無皮疹，左側脖子有兩顆淋巴結，心臟、胸腔和腹部正常。下肢有輕度水腫。尿液分析：蛋白質 300 mg/dL，每高倍鏡下 RBC 35-45, WBC 10-15, RBC casts 2-4。全血球數檢查：Hb 10.6 g/dL,  mg/dL, 肌酸酐 1.8 mg/dL。下列那個處置是最適當的？
A. 檢查血清 ANA, C3 濃度，並安排腎臟切片檢查
B. 安排胃鏡檢查
C. 給予輸血
D. 尿液細菌培養，並給予抗生素兩週

正確答案：A. 檢查血清 ANA, C3 濃度，並安排腎臟切片檢查